Clinical trial inclusion criterion:
1. Patients ≥ 18 years-old from "Instituto Teletón Santiago" and "Hospital Clínico Mutual de seguridad".

Annotated entities:
- Parsing_Error: "1."
- Value: "≥ 18 years"
- Person: "years-old"
- Visit: "Instituto Teletón Santiago"
- Visit: "Hospital Clínico Mutual de seguridad"
- Grammar_Error: "and"